下列何種人體寄生蟲之絲狀幼蟲的尾端會呈現分叉狀（notched tail）？
A. 美洲鉤蟲（Necator americanus）
B. 十二指腸鉤蟲（Ancylostoma duodenale）
C. 糞小桿線蟲（Strongyloides stercoralis）
D. 蟯蟲（Enterobius vermicularis）

正確答案：C. 糞小桿線蟲（Strongyloides stercoralis）